Genéricamente, las citocinas:
1. Están entre las proteínas de más alto peso molecular.
2. Tienen una vida media en suero muy corta.
3. Actúan a concentraciones muy altas.
4. En cuanto a la expresión del receptor de la IL-2.

Respuesta correcta: 2. Tienen una vida media en suero muy corta.